一般有插入鼻胃管的成年病人，發現有多量類似膽汁的鼻胃管分泌物，下列何種輸液補充最為恰當?
A. 食鹽水（normal saline）
B. 葡萄糖水（glucose water）
C. 林格氏乳酸液（lactated Ringer's solution）
D. 半食鹽水（half saline）

正確答案：C. 林格氏乳酸液（lactated Ringer's solution）